有關復健的概念，下列何者錯誤？
A. 只要有功能障礙，愈早介入愈好
B. 必須找出正確診斷，才能有正確的訓練復健目標
C. 多元專業模式（multidisciplinary）是最佳的復健模式
D. 必須要家庭參與及居家訓練，才能成功

正確答案：C. 多元專業模式（multidisciplinary）是最佳的復健模式